Patients who have planning for follow-up in another center

The above is a clinical trial exclusion criterion. Annotated with entity spans:
Patients who have [Mood: planning for] [Procedure: follow-up] in [Visit: another center]